下列何種合成的雌激素，可以作為口服避孕藥（oral contraceptives）使用？
A. danazol
B. desogestrel
C. mestranol
D. letrozole

正確答案：C. mestranol